Subject is able to produce sputum, undergo phlebotomy, and provide written consent.

The above is a clinical trial inclusion criterion. Annotated with entity spans:
[Post-eligibility: Subject is able to produce sputum, undergo phlebotomy, and provide written consent.]